新生兒發生猛爆型肝炎，下列何者與病人之預後最具相關性？
A. 凝血原時間（prothrombin time）
B. 血清膽紅素值
C. 血清轉氨值
D. 血清胎兒蛋白值

正確答案：A. 凝血原時間（prothrombin time）